沙門氏菌（salmonella）會引起兒童的細菌性腸胃炎，關於沙門氏菌的敘述，下列何者錯誤？
A. 免疫不全的病童比一般兒童更容易發生菌血症
B. 當腸胃炎孩童只有糞便培養出沙門氏菌，但血液培養未長菌，標準治療是及早給與抗生素
C. 幼童應避免接觸爬蟲類、兩棲類的動物，以免被沙門氏菌感染
D. 沙門氏菌腸炎的併發症包含反應性關節炎（reactive arthritis）

正確答案：B. 當腸胃炎孩童只有糞便培養出沙門氏菌，但血液培養未長菌，標準治療是及早給與抗生素